下列有關 PJ 症狀群（Peutz-Jeghers syndrome）的敘述，何者錯誤？
A. 出現多發性息肉，最多在小腸，為缺陷瘤性（hamartomatous）息肉
B. 病人的嘴唇、口頰或腳趾皮膚有色素沈著
C. 息肉可能變大或出血，造成腸阻塞或腸套疊
D. 息肉本身就是一種惡性病變，因此要將所有息肉切除乾淨

正確答案：D. 息肉本身就是一種惡性病變，因此要將所有息肉切除乾淨